Clinical trial exclusion criterion:
Minors

Annotated entities:
- Person: "Minors"